Which X chromosome abnormalities present lupus-like symptoms?

The accelerated development of systemic lupus erythematosus (SLE) in male BXSB mice is associated with the genetic abnormality in its Y chromosome, designated Yaa (Y-linked autoimmune acceleration) but additional contributions from other duplicated genes in the translocated X chromosome also exist